What is RiboTag profiling?

RiboTag is a flexible tool for measuring the translational state of targeted cells in heterogeneous cell cultures. RiboTag immunoprecipitation is capable of recovering high integrity RNA from small numbers of transfected cells that can then be interrogated by a variety of methods (e.g., RT-qPCR, PCR array, RNA-Seq) and compared with basal RNA expression of the entire culture. Co-transfection of RiboTag with small hairpin RNA (shRNA) constructs can validate and accurately assess the degree of gene expression knockdown.